下列何者阻塞時，最可能造成右側肢體無力及運動型失語症（Broca's aphasia）？
A. 前大腦動脈
B. 中大腦動脈
C. 後大腦動脈
D. 椎動脈

正確答案：B. 中大腦動脈